Clinical trial inclusion criterion:
Normal menstrual cycles: 25-34 days

Annotated entities:
- Condition: "Normal menstrual cycles"
- Value: "25-34 days"